Clinical trial exclusion criterion:
Significant arterial disease (Ankle Brachial Pressure Index <0•9 or evidence on Arterial Duplex)

Entity relations:
- Has_qualifier("arterial disease", "Significant")
- AND("Arterial Duplex", "arterial disease")
- Has_value("Ankle Brachial Pressure Index", "<0•9")
- OR("Ankle Brachial Pressure Index", "Arterial Duplex")